Clinical trial inclusion criterion:
ECOG performance status of 0-2

Annotated entities:
- Measurement: "ECOG performance status"
- Value: "0-2"